下列何種胺基酸為合成一氧化氮（NO）的前驅物？
A. Arginine
B. Tryptophan
C. Lysine
D. Methionine

正確答案：A. Arginine